Los tosilatos se utilizan frecuentemente como:
1. Grupos salientes en reacciones de sustitución y eliminación.
2. Disolventes en reacciones de sustitución y eliminación.
3. Grupos protectores en reacciones de reducción.
4. Reactivos nucleófilos.

Respuesta correcta: 1. Grupos salientes en reacciones de sustitución y eliminación.